有關喉部血管性水腫（laryngeal angioedema）之敘述，下列何者錯誤？
A. 組織血管擴張，血管通透性增加組織水腫，可能致命
B. 可由注射藥物，食物或昆蟲咬傷等所引起
C. 治療須迅速使用腎上腺素（epinephrine）、氧氣、抗組織胺（antihistamine）及類固醇（steroid）
D. 此疾病僅局限於喉部

正確答案：D. 此疾病僅局限於喉部